The contraceptive patch

The above is a clinical trial exclusion criterion. Annotated with entity spans:
The [Device: contraceptive patch]